Clinical trial exclusion criterion:
Subject with a history of a positive test for Hepatitis B surface antigen (HbsAg) or Hepatitis C

Entity relations:
- Has_value("test for Hepatitis B surface antigen (HbsAg)", "positive")
- Has_temporal("test for Hepatitis B surface antigen (HbsAg)", "history of")
- OR("test for Hepatitis B surface antigen (HbsAg)", "test for Hepatitis C")